Clinical trial inclusion criterion:
patients who need suturing for laceration under procedural anesthesia using ketamine

Entity relations:
- AND("procedural anesthesia", "ketamine")
- AND("suturing", "procedural anesthesia")
- AND("suturing", "laceration")